下列降血壓藥物中，何者可增加血管平滑肌細胞內 cGMP 濃度而使血管舒張？
A. Minoxidil
B. Nifedipine
C. Prazosin
D. Sodium nitroprusside

正確答案：D. Sodium nitroprusside